Una característica química de los acetales es:
1. Se pueden preparar a partir de aldehídos pero no de cetonas.
2. No son estables en disolución acuosa a pH básico fuerte.
3. Son estables en presencia de compuestos organolíticos (RLi).
4. Son estables a la hidrolisis catalizada por ácido.

Respuesta correcta: 3. Son estables en presencia de compuestos organolíticos (RLi).